Clinical trial exclusion criterion:
Patients with active or suspected acute or chronic uncontrolled infection including abcesses or fistulae

Entity relations:
- Subsumes("uncontrolled infection", "abcesses")
- Has_qualifier("uncontrolled infection", "active")
- Has_qualifier("uncontrolled infection", "acute")
- OR("abcesses", "fistulae")
- OR("active", "suspected")
- OR("acute", "chronic")